Signed informed consent form.

The above is a clinical trial inclusion criterion. Annotated with entity spans:
[Informed_consent: Signed informed consent form].